Clinical trial inclusion criterion:
Hematologic ANC > 1000/uL and platelet > 75,000/uL,

Annotated entities:
- Measurement: "Hematologic ANC"
- Value: "> 1000/uL"
- Measurement: "platelet"
- Value: "> 75,000/uL"